Clinical trial inclusion criterion:
Men or non-pregnant women of any ethnic background between the age of 18 and 45 years old

Entity relations:
- Has_qualifier("women", "non-pregnant")
- Has_value("age", "18 and 45 years old")
- OR("Men", "women")